Clinical trial exclusion criterion:
Invasive fungal infections in history and at present

Annotated entities:
- Condition: "fungal infections"
- Qualifier: "Invasive"